Able to understand and provide consent in English or Spanish

The above is a clinical trial inclusion criterion. Annotated with entity spans:
[Post-eligibility: Able to understand and provide consent in English or Spanish]